下列那一解剖構造開口於下鼻道？
A. 上頜竇開口
B. 額竇開口
C. 蝶竇開口
D. 鼻淚管

正確答案：D. 鼻淚管